Which micro-RNAs (miR) are associated with the human cycloxygenase-2 (COX-2) gene promoter?

Recently, the human cycloxygenase-2 (COX-2) gene promoter has a microRNA (miR) promoter region that is highly expressed in non-cancer cells and is associated with the cell cycle. MicroRNA-16, miRNA-128, microRNA-26a, miRNAs-142-3p, miR-144, mi R-146b-3 p, mir-146a, icroRNA- 26a, -26b,microRNA-137, mi r-146 a, mir-143-5p,